Patient is willing and able to provide informed written consent

The above is a clinical trial inclusion criterion. Annotated with entity spans:
[Post-eligibility: Patient is willing and able to provide informed written consent]